Patients of which disease could be treated by utilizing knowledge obtained from experiments suppressing TDP-43 toxicity in yeast?

Amyotrophic lateral sclerosis (ALS).